Clinical trial exclusion criterion:
Had dose increase of anti-TNF agent or DMARD in the last 6 months

Annotated entities:
- Drug: "anti-TNF agent"
- Drug: "DMARD"
- Multiplier: "dose increase"
- Temporal: "in the last 6 months"